Patients with an absolute body weight of less than 41 kilograms (90.4 lbs) at baseline visit;

The above is a clinical trial exclusion criterion. Annotated with entity spans:
Patients with an absolute [Measurement: body weight] of [Value: less than 41 kilograms] ([Value: 90.4 lbs]) at baseline visit;